HbA1c < 75 mmol/mol (9.0%)

The above is a clinical trial inclusion criterion. Annotated with entity spans:
[Measurement: HbA1c] [Value: < 75 mmol/mol] ([Value: 9.0%])